Clinical trial exclusion criterion:
Pregnant female, as determined for women less than 60 years old by a positive urine pregnancy test during the screening window.

Entity relations:
- Has_value("old", "less than 60 years")
- Has_temporal("urine pregnancy test", "during the screening window")
- Has_value("urine pregnancy test", "positive")